Clinical trial exclusion criterion:
6. Lifetime history of major depressive disorder, schizophrenia, bipolar disorder, mania, or hypomania.

Annotated entities:
- Parsing_Error: "6."
- Temporal: "Lifetime history of"
- Condition: "major depressive disorder"
- Condition: "schizophrenia"
- Condition: "bipolar disorder"
- Condition: "mania"
- Condition: "hypomania"